Clinical trial exclusion criterion:
acute cardiovascular or cerebrovascular accidents within past 3 months;

Annotated entities:
- Condition: "accidents cardiovascular"
- Condition: "cerebrovascular accidents"
- Qualifier: "acute"
- Temporal: "within past 3 months"